Clinical trial exclusion criterion:
Patient has previously received or is receiving an organ transplant other than a liver.

Annotated entities:
- Procedure: "organ transplant"
- Negation: "other than"
- Qualifier: "liver"